珠珠被懷疑因大出血造成 Sheehan syndrome，下列何種產後症狀與此關聯性較高？
A. 珠珠因餵奶知識豐富，奶量充沛（Profuse lactation）
B. 無月經（Amenorrhea）
C. 甲狀腺亢進（Hyperthyroidism）
D. 腎臟功能不足（Renal insufficiency）

正確答案：B. 無月經（Amenorrhea）